Clinical trial inclusion criterion:
Female or male patients.

Annotated entities:
- Person: "Female"
- Person: "male"